Clinical trial exclusion criterion:
immunosuppression including AIDS, corticosteroids over 60mg/day

Annotated entities:
- Condition: "immunosuppression"
- Condition: "AIDS"
- Drug: "corticosteroids"
- Multiplier: "over 60mg/day"